Clinical trial inclusion criterion:
Symptoms present more than six months

Entity relations:
- Has_temporal("Symptoms", "more than six months")